Clinical trial exclusion criterion:
Pregnant or lactating women

Entity relations:
- OR("Pregnant", "lactating")